Clinical trial exclusion criteria:
Patients unable to give informed consent.
Any patient whose condition will not allow for placement of the electrode PadSet.
Patients whose tracheas were not extubated in OR or PACU.
Patients with Impaired Renal Function with a have a known estimated CrCl<30 ml/min
Patients using oral contraception.

Annotated entities:
- Informed_consent: "Patients unable to give informed consent"
- Condition: "condition"
- Negation: "not"
- Mood: "allow"
- Procedure: "placement"
- Device: "electrode PadSet"
- Procedure: "extubated"
- Qualifier: "tracheas"
- Negation: "not"
- Visit: "OR"
- Visit: "PACU"
- Condition: "Impaired Renal Function"
- Measurement: "estimated CrCl"
- Value: "<30 ml/min"
- Procedure: "oral contraception"
- Drug: "oral contraception"